Clinical trial exclusion criterion:
Significant renal disease manifested by creatinine clearance of < 30 ml/min)

Annotated entities:
- Qualifier: "Significant"
- Condition: "renal disease"
- Measurement: "creatinine clearance"
- Value: "< 30 ml/min"